Age =18 and = 65 years

The above is a clinical trial inclusion criterion. Annotated with entity spans:
[Person: Age] [Value: =18 and = 65 years]